Inclusion Criteria Patients: Fulfilling the diagnostic criteria of schizophrenia or schizoaffective disorder according to ICD-10 (International Classification of Diseases version 10) or DSM-IV/V (Diagnostic and Statistical Manual version 4 /5), Age 18-45 years, Never treated with antipsychotic compounds or central nervous system (CNS) stimulants, Legally competent

The above is a clinical trial inclusion criterion. Annotated with entity spans:
Inclusion Criteria [Observation: Patients]: Fulfilling the diagnostic criteria of [Condition: schizophrenia] or [Condition: schizoaffective disorder] according to [Qualifier: ICD-10 (International Classification of Diseases version 10)] or [Qualifier: DSM-IV/V (Diagnostic and Statistical Manual version 4 /5)], [Person: Age] [Value: 18-45 years], [Negation: Never] treated with [Drug: antipsychotic compounds] or [Drug: central nervous system (CNS) stimulants], [Observation: Legally competent]